Clinical trial exclusion criterion:
Pregnancy (urine pregnancy tests on the day of scans for menstruating girls).

Annotated entities:
- Condition: "Pregnancy"
- Procedure: "urine pregnancy tests"
- Temporal: "on the day of scans"
- Person: "menstruating girls"